Clinical trial inclusion criterion:
No previous treatment with hematopoietic growth factors within 3 months prior to screening

Annotated entities:
- Drug: "hematopoietic growth factors"
- Temporal: "within 3 months prior to screening"
- Reference_point: "screening"